Born at University of New Mexico Hospital

The above is a clinical trial inclusion criterion. Annotated with entity spans:
[Person: Born] at [Visit: University of New Mexico Hospital]